心臟手術時使用的人工心肺機包含下列那些裝置？①熱交換器（heat exchanger） ②主動脈	夾（aortic clamp） ③幫浦（pump） ④氧合器（oxygenator）
A. ①②③
B. ②③④
C. ①②④
D. ①③④

正確答案：D. ①③④